Clinical trial exclusion criterion:
5. ADC Stage > 1.

Annotated entities:
- Measurement: "ADC Stage"
- Value: "> 1"